Diagnosis of DSM 5 Anxiety Disorder

The above is a clinical trial inclusion criterion. Annotated with entity spans:
Diagnosis of [Condition: DSM 5 Anxiety Disorder]